Clinical trial exclusion criterion:
Underlying medical condition with survival unlikely during follow-up period

Entity relations:
- AND("medical condition", "survival unlikely")